Clinical trial exclusion criterion:
Allergy or intolerance to aspirin or clopidogrel.

Entity relations:
- AND("Allergy", "aspirin")
- OR("aspirin", "clopidogrel")
- OR("Allergy", "intolerance")